asthma or COPD

The above is a clinical trial inclusion criterion. Annotated with entity spans:
[Condition: asthma] or [Condition: COPD]